Clinical trial exclusion criterion:
Donation or loss of 400 mL or more of blood within 8 weeks prior to dosing.

Entity relations:
- Has_value("Donation of blood", "400 mL or more")
- Has_value("loss of blood", "400 mL or more")
- Has_temporal("Donation of blood", "within 8 weeks prior")
- Has_temporal("loss of blood", "within 8 weeks prior")
- OR("Donation of blood", "loss of blood")